La Diabetes Insípida:
1. Es una enfermedad vinculada a la disfunción de la hipófisis anterior.
2. Se controla limitando la ingestión de líquidos.
3. Se manifiesta por polidipsia y la eliminación de grandes volúmenes de orina diluida.
4. Se origina en el páncreas.
5. Está causada por la producción excesiva de ADH (Vasopresina).

Respuesta correcta: 3. Se manifiesta por polidipsia y la eliminación de grandes volúmenes de orina diluida.